Known allergy or lack of response to mirtazapine.

The above is a clinical trial exclusion criterion. Annotated with entity spans:
Known [Condition: allergy] or [Condition: lack of response] to [Drug: mirtazapine].